Resistant hypertension, defined as BP > 140/90, despite the use of three or more anti-hypertensive drugs

The above is a clinical trial exclusion criterion. Annotated with entity spans:
[Qualifier: Resistant] [Condition: hypertension], defined as [Measurement: BP] [Value: > 140/90], [Qualifier: despite the use of three or more anti-hypertensive drugs]